下列何者不是胃繞道減重手術（Roux-en-Y gastric bypass）長期術後常見的合併症？
A. 邊緣性潰瘍（marginal ulcer）
B. 鐵吸收不良（iron deficiency）
C. 膽汁逆行性食道炎（bile reflux esophagitis）
D. 腹腔內腸疝氣（internal hernia）

正確答案：C. 膽汁逆行性食道炎（bile reflux esophagitis）